Clinical trial inclusion criterion:
have no serologic evidence of active HBV infection evidenced by negative hepatitis B surface antigen

Annotated entities:
- Condition: "serologic evidence of active HBV infection"
- Condition: "HBV infection"
- Measurement: "hepatitis B surface antigen"
- Value: "negative"